在不分泌唾液的狀況下，下列那些營養成分在人體中仍可被消化？①醣類 ②脂肪 ③蛋白質
A. 僅①②
B. 僅②③
C. 僅①③
D. ①②③

正確答案：D. ①②③